思覺失調症（schizophrenia）的治療藥物有許多副作用，下列何種副作用與dopamine receptor的阻斷有關？
A. 高泌乳素血症
B. 口乾
C. 姿勢性低血壓
D. 視覺模糊

正確答案：A. 高泌乳素血症